45 歲男性病人因胰臟炎而長期服用嗎啡，現因股骨骨折而須進行手術，下列有關之敘述，何者錯 誤？
A. 使用全身麻醉較半身麻醉為佳
B. 術後止痛可以使用 NSAID
C. 可以使用類鴉片類（opioids）止痛藥物
D. 可以使用病人自控止痛裝置

正確答案：A. 使用全身麻醉較半身麻醉為佳